Clinical trial exclusion criterion:
Cirrhosis hepatis (Child B or higher)

Annotated entities:
- Condition: "Cirrhosis hepatis"
- Measurement: "Child"
- Value: "B or higher"
- Qualifier: "Child B or higher"